急性肌腔室症候群（acute compartment syndrome）是骨科急症之一，若未即時進行減壓手術，將導致組織 缺血及壞死。關於急性肌腔室症候群之敘述，下列何者錯誤？
A. 骨折是最常見的原因
B. 受到創傷後，大腿遠比小腿容易發生
C. 即使患側肢體的周邊脈搏搏動（peripheral pulse）及微血管回流（capillary return）正常，仍不可排除
D. 疼痛常是最早出現的症狀

正確答案：B. 受到創傷後，大腿遠比小腿容易發生